有關 juvenile rheumatoid arthritis（JRA）的敘述，下列何者錯誤？
A. 生長和發展異常是 JRA 常見的併發症
B. 若侵犯到 TMJ（temporomandibular joints），可導致 macrognathia
C. 不對稱的下肢關節炎，常導致雙腳不等長
D. Leg length 不同也可因 pelvic rotation 和 scoliosis 所造成

正確答案：B. 若侵犯到 TMJ（temporomandibular joints），可導致 macrognathia